Clinical trial exclusion criterion:
Hypersensitivity to vitamin K

Annotated entities:
- Condition: "Hypersensitivity"
- Drug: "vitamin K"